Where are the orexigenic peptides synthesized?

The orexigenic peptides are sythesized in the hypothalamus.